The patients have history of neoadjuvant hormone therapy.

The above is a clinical trial exclusion criterion. Annotated with entity spans:
The patients have history of [Procedure: neoadjuvant hormone therapy].